Clinical trial exclusion criterion:
periprocedural complications requiring continuation of heparin or administration of protamine sulfate

Annotated entities:
- Condition: "periprocedural complications"
- Drug: "heparin"
- Drug: "protamine sulfate"
- Mood: "requiring"